Clinical trial exclusion criterion:
Secondary Sjögren's syndrome;

Annotated entities:
- Condition: "Sjögren's syndrome"
- Qualifier: "Secondary"